Clinical trial exclusion criterion:
Subjects taking any lipid modification therapy, including but not limited to statins, fibrates and bile acid sequestrants.

Entity relations:
- Subsumes("lipid modification therapy", "statins")
- Subsumes("lipid modification therapy", "and")
- OR("statins", "fibrates", "bile acid sequestrants")